La lectina ligadora de manosa (o manano) tiene una estructura que recuerda a:
1. La properdina.
2. Una IgM.
3. C1q.
4. Una pentraxina.

Respuesta correcta: 3. C1q.